Clinical trial exclusion criterion:
Stroke or transient ischemic attack

Entity relations:
- OR("Stroke", "transient ischemic attack")